Suspected current drug or alcohol abuse

The above is a clinical trial exclusion criterion. Annotated with entity spans:
[Observation: Suspected] [Temporal: current] [Condition: drug] or [Condition: alcohol abuse]